心臟疾病中造成腦栓塞（cerebral embolism）最多的病症是：
A. 心房顫動（atrial fibrillation）
B. 心肌梗塞（myocardial infarction）
C. 心肌炎（myocarditis）
D. 心衰竭（heart failure）

正確答案：A. 心房顫動（atrial fibrillation）